PLT = 80 × 109 / L

The above is a clinical trial inclusion criterion. Annotated with entity spans:
[Measurement: PLT] [Value: = 80 × 109 / L]